Clinical trial exclusion criterion:
Patient who is HbsAg negative has received an HbsAg positive (HBV DNA by PCR or HBV antibody) donor liver

Annotated entities:
- Measurement: "HbsAg"
- Value: "negative"
- Measurement: "HbsAg"
- Value: "positive"
- Measurement: "PCR"
- Measurement: "HBV DNA"
- Measurement: "HBV antibody"
- Person: "donor"
- Qualifier: "liver"